Clinical trial inclusion criterion:
Adequate liver function - serum total bilirubin concentration less than 1.5 x upper limit of normal value

Entity relations:
- Has_value("serum total bilirubin concentration", "less than 1.5 x upper limit of normal value")
- Has_value("liver function", "Adequate")
- Subsumes("Adequate", "serum total bilirubin concentration")